有關透納氏症（Turner syndrome）的敘述，下列何者錯誤？
A. Ｘ染色體短臂上有SHOX基因，因此病患會有矮小症狀（short stature）
B. 可能有左心異常（left-heart abnormalities）
C. 因為是性染色體異常，所以有性腺發育不全（gonadal dysgenesis）
D. 智力皆不受影響，完全正常

正確答案：D. 智力皆不受影響，完全正常